Clinical trial exclusion criterion:
BCVA over 77 letters between screening and Day 0

Annotated entities:
- Measurement: "BCVA"
- Value: "over 77 letters"